Clinical trial exclusion criterion:
preoperative history of schizophrenia, epilepsy, parkinsonism, use of cholinesterase inhibitor, inability to communicate in the preoperative period (coma, profound dementia, or language barrier).

Entity relations:
- OR("coma", "profound dementia")